Clinical trial exclusion criteria:
thrombus in the LA or LAA;
mechanical valve prosthesis;
mitral stenosis;
previous LAA ligation during cardiac surgery;
life expectancy less than 2 years;
comorbidities other than AF, which present an indication for anticoagulation;
patent foramen ovale with atrial septal aneurysm
mobile plaque in the aorta;
symptomatic atherosclerosis of the carotid artery;
pericardial effusion greater than 10 mm;
clinically significant bleeding within the 30 days prior to the scheduled procedure;
stroke or other cardioembolic event within the 30 days prior to the scheduled procedure;
acute coronary syndrome within the 90 days prior to the scheduled procedure,
gravidity,
significant valvular disease,
creatinine clearance less than 30 ml/min

Annotated entities:
- Condition: "thrombus"
- Qualifier: "LA"
- Qualifier: "LAA"
- Device: "mechanical valve prosthesis"
- Condition: "mitral stenosis"
- Procedure: "LAA ligation"
- Procedure: "cardiac surgery"
- Observation: "life expectancy"
- Value: "less than 2 years"
- Condition: "AF"
- Negation: "other than"
- Condition: "comorbidities"
- Condition: "indication"
- Procedure: "anticoagulation"
- Condition: "patent foramen ovale"
- Condition: "atrial septal aneurysm"
- Condition: "mobile plaque in the aorta"
- Condition: "atherosclerosis"
- Qualifier: "symptomatic"
- Qualifier: "of the carotid artery"
- Condition: "pericardial effusion"
- Qualifier: "greater than 10 mm"
- Qualifier: "clinically significant"
- Condition: "bleeding"
- Temporal: "within the 30 days prior to the scheduled procedure"
- Reference_point: "the scheduled procedure"
- Condition: "stroke"
- Qualifier: "other"
- Condition: "cardioembolic event"
- Temporal: "within the 30 days prior to the scheduled procedure"
- Reference_point: "the scheduled procedure"
- Condition: "acute coronary syndrome"
- Temporal: "within the 90 days prior to the scheduled procedure"
- Reference_point: "the scheduled procedure"
- Condition: "gravidity"
- Condition: "valvular disease"
- Qualifier: "significant"
- Measurement: "creatinine clearance"
- Value: "less than 30 ml/min"